Clinical trial exclusion criterion:
Known uncontrolled systemic illness (uncontrolled diabetes, human immunodeficiency virus, vasculitis, autoimmune/inflammatory disease)

Annotated entities:
- Condition: "systemic illness"
- Qualifier: "uncontrolled"
- Qualifier: "uncontrolled"
- Condition: "diabetes"
- Condition: "human immunodeficiency virus"
- Condition: "vasculitis"
- Condition: "autoimmune"
- Condition: "inflammatory disease"